Clinical trial exclusion criteria:
A previous history of intolerance to the study drug or related compounds and additives
History of alcoholism, drug abuse, psychiatric, psychological or other emotional problems that are likely to invalidate informed consent
Sleep apnoea
Chronic obstructive pulmonary disease
BMI = 35 or weight < 50 kg
SpO2 < 90 %
Concomitant drug therapy known to cause significant enzyme induction or inhibition of CYP 3A4.
Pregnancy or nursing.

Annotated entities:
- Temporal: "previous history"
- Condition: "intolerance"
- Drug: "study drug"
- Drug: "related compounds"
- Condition: "alcoholism"
- Condition: "drug abuse"
- Condition: "psychiatric problems"
- Condition: "psychological problems"
- Condition: "emotional problems"
- Condition: "Sleep apnoea"
- Condition: "Chronic obstructive pulmonary disease"
- Measurement: "BMI"
- Value: "= 35"
- Measurement: "weight"
- Value: "< 50 kg"
- Measurement: "SpO2"
- Value: "< 90 %"
- Measurement: "drug therapy"
- Temporal: "Concomitant"
- Observation: "enzyme induction of CYP 3A4"
- Observation: "enzyme inhibition of CYP 3A4"
- Condition: "Pregnancy"
- Condition: "nursing"